En determinadas ocasiones, cuando nos formamos una impresión de los demás, nos influyen nuestras creencias acerca de los rasgos que van unidos en las personas. ¿Qué teorías ponen este hecho de relieve?
1. Teorías Implícitas de la Personalidad.
2. Teorías de las Inferencias Correspondientes.
3. Teorías de la Integración de la Información.
4. Teorías de los Rasgos Centrales.
5. Teoría de la Identidad Social.

Respuesta correcta: 1. Teorías Implícitas de la Personalidad.